What is caused by the ectopic expression of CTCF?

Enforced ectopic expression of CTCF inhibits cell growth in culture. ectopic expression of CTCF in K562 cells led to growth retardation and promotion of differentiation into the erythroid lineage;